Clinical trial exclusion criterion:
Coagulopathies diagnosed by a physician or report of capillary fragility (ex: bruises or bleedings without justifiable cause;

Entity relations:
- Has_qualifier("bleedings", "without justifiable cause")
- Has_qualifier("bruises", "without justifiable cause")
- AND("capillary fragility", "bruises")
- AND("Coagulopathies", "capillary fragility")
- OR("bruises", "bleedings")